Típicamente las especies del género Leptospira:
1. Tienen movimiento por flagelación perítrica.
2. Presentan endoflagelos.
3. Son anaerobias.
4. Forman prostecas.
5. Son comensales.

Respuesta correcta: 2. Presentan endoflagelos.